Oxygen saturation < 90%

The above is a clinical trial inclusion criterion. Annotated with entity spans:
[Measurement: Oxygen saturation] [Value: < 90%]